Clinical trial inclusion criterion:
1. Age 18 years or older

Entity relations:
- Has_value("Age", "18 years or older")